下列有關脊髓丘腦徑（spinothalamic tract）的敘述，何者錯誤？
A. 屬於前外側系統（anterolateral system）
B. 傳導痛覺
C. 其神經纖維通過脊髓背側白質交叉（dorsal white commissure）
D. 其神經纖維主要由脊髓背角之神經元發出

正確答案：C. 其神經纖維通過脊髓背側白質交叉（dorsal white commissure）